Tras la ingesta aumenta la liberación de:
1. Insulina.
2. ACTH.
3. Cortisol.
4. Adrenalina de la médula adrenal.
5. GH.

Respuesta correcta: 1. Insulina.